小腦功能分區負責平衡的是：
A. 絨球小結葉及蚓垂
B. 前葉
C. 後葉
D. 小腦半球側部

正確答案：A. 絨球小結葉及蚓垂